30 歲男性工人，工作時被玻璃割傷，前臂腹面，離腕關節 3 公分的小指側有一 2 公分傷口，檢查時，有血液湧出，請問最可能是下列何構造受損？
A. 橈動脈
B. 尺動脈
C. 臂動脈
D. 指動脈

正確答案：B. 尺動脈